Clinical trial inclusion criterion:
Males and females who are at least 18 years of age at time of enrollment.

Entity relations:
- Has_index("at time of enrollment", "time of enrollment")